Clinical trial inclusion criterion:
Patients aged between 18 and 75 years;

Entity relations:
- Has_value("aged", "between 18 and 75 years")